Clinical trial exclusion criterion:
amide and/or esther local anaesthetic allergy

Entity relations:
- AND("allergy", "amide local anaesthetic")
- OR("amide local anaesthetic", "esther local anaesthetic")